Clinical trial exclusion criterion:
Kidney disease not caused by diabetes or hypertension

Annotated entities:
- Condition: "Kidney disease"
- Condition: "diabetes"
- Condition: "hypertension"